35歲未哺乳的女性病人，最近發現左側乳頭有血樣分泌物（bloody discharge），觸診發現乳暈下兩點鐘方向有硬塊，下列敘述何者錯誤？
A. 應安排乳房攝影、乳房超音波檢查
B. 可安排乳管攝影（ductography）檢查
C. 測量血液中CEA、CA 15-3 濃度以排除乳癌可能性
D. 應儘快安排手術切除

正確答案：C. 測量血液中CEA、CA 15-3 濃度以排除乳癌可能性